Clinical trial inclusion criterion:
Absent irreversible pulpal alteration;

Annotated entities:
- Condition: "irreversible pulpal alteration"
- Negation: "Absent"